A signed and dated written informed consent is obtained prior to participation.

The above is a clinical trial inclusion criterion. Annotated with entity spans:
A signed and dated [Observation: written informed consent] is obtained [Temporal: prior to participation].